Women who are pregnant, nursing, or who plan to become pregnant while in the trial.

The above is a clinical trial exclusion criterion. Annotated with entity spans:
[Pregnancy_considerations: Women who are pregnant, nursing, or who plan to become pregnant while in the trial.]